Un profesional sanitario queda eximido de la obligación del secreto profesional ante la siguiente circunstancia:
1. Presencia de alguna enfermedad infecciosa.
2. Intento de suicidio.
3. Negativa del paciente a evitar el contagio a otras personas.
4. Sospecha de malos tratos.
5. Ante el requerimiento de un abogado.

Respuesta correcta: 3. Negativa del paciente a evitar el contagio a otras personas.